Clinical trial inclusion criterion:
Age > 40 years (45)

Entity relations:
- Has_value("Age", "> 40 years")